Prior treatment toxicities have not resolved to < Grade 2 according to NCI CTCAE Version 4.0 (except clinically insignificant toxicities such as alopecia).

The above is a clinical trial exclusion criterion. Annotated with entity spans:
[Context_Error: Prior treatment toxicities have not resolved to < Grade 2 according to NCI CTCAE Version 4.0 (except clinically insignificant toxicities such as alopecia).]